Patient with known or suspected cirrhosis

The above is a clinical trial inclusion criterion. Annotated with entity spans:
Patient with [Mood: known] or [Mood: suspected] [Condition: cirrhosis]